錐鼻蟲（kissing bug）可傳播下列何種寄生蟲病？
A. 恰加斯氏病（Chagas' disease）
B. 岡比亞錐蟲病（Gambian trypanosomiasis）
C. 羅德西亞錐蟲病（Rhodesian trypanosomiasis）
D. 利什曼蟲病（Leishmaniasis）

正確答案：A. 恰加斯氏病（Chagas' disease）